女性的肺癌以下列何種組織型態最常見？
A. 腺癌
B. 狀上皮細胞癌
C. 小細胞癌
D. 大細胞癌

正確答案：A. 腺癌